Must have good compliance with medications Patients with asthma and COPD.

The above is a clinical trial inclusion criterion. Annotated with entity spans:
Must have [Condition: good compliance] with [Drug: medications] Patients with [Condition: asthma] and [Condition: COPD].